Clinical trial exclusion criterion:
Participation in another clinical study of an investigational product currently or within the past 90 days, or expected participation during this study

Annotated entities:
- Competing_trial: "Participation in another clinical study of an investigational product currently or within the past 90 days, or expected participation during this study"